Clinical trial inclusion criterion:
Patients with rectal cancer stage: cT1-2-3, cN0-1, cM0.

Annotated entities:
- Condition: "rectal cancer"
- Qualifier: "stage"
- Measurement: "cT"
- Measurement: "cN"
- Measurement: "cM"
- Value: "1-2-3"
- Value: "0-1"
- Value: "0"